Clinical trial exclusion criterion:
Patients with azathioprine or biologics therapy

Entity relations:
- AND("therapy", "azathioprine")
- OR("azathioprine", "biologics")